Clinical trial exclusion criterion:
Estimated GFR (eGFR) < 60 mL/min/1.73 m2 and blood glucose > 135 mg/dl; Past or present history of acute renal failure, renal dialysis, diabetes mellitus.

Entity relations:
- Subsumes("Estimated GFR", "eGFR")
- Has_value("Estimated GFR", "< 60 mL/min/1.73 m2")
- Has_value("blood glucose", "> 135 mg/dl")
- OR("Estimated GFR", "blood glucose", "acute renal failure", "renal dialysis", "diabetes mellitus")